Radiofrequency treatment history,

The above is a clinical trial exclusion criterion. Annotated with entity spans:
[Procedure: Radiofrequency treatment] [Temporal: history],